Clinical trial exclusion criterion:
For colorectal cancer patients in the expanded cohorts, prior treatment with more than 2 systemic chemotherapy regimens in the metastatic setting

Annotated entities:
- Condition: "colorectal cancer"
- Procedure: "treatment"
- Temporal: "prior"
- Value: "more than 2"
- Procedure: "systemic chemotherapy regimens"
- Qualifier: "metastatic"